En el cambio de isotipo de cadena pesada de inmunoglubina en los linfocitos B, desempeña una función clave:
1. La recombinasa V(D)J.
2. La proteína RAG-1.
3. La tirosina cinasa de Bruton (BTK).
4. La desaminasa inducida por la activación (AID).

Respuesta correcta: 4. La desaminasa inducida por la activación (AID).